are pregnant or think you might be pregnant

The above is a clinical trial exclusion criterion. Annotated with entity spans:
are [Condition: pregnant] or [Mood: think you might be] [Condition: pregnant]